Clinical trial inclusion criterion:
Infection with Plasmodium falciparum or P. vivax either alone or mixed

Entity relations:
- Has_qualifier("Infection", "Plasmodium falciparum")
- OR("Plasmodium falciparum", "P. vivax")